Clinical trial inclusion criterion:
4. Oral temperature > 38 C

Annotated entities:
- Parsing_Error: "4."
- Measurement: "Oral temperature"
- Value: "> 38 C"